male patients with androgenetic alopecia between 18 years and 60 years

The above is a clinical trial inclusion criterion. Annotated with entity spans:
[Person: male] patients with [Condition: androgenetic alopecia] [Value: between 18 years and 60 years]